El test de imitación de gestos (Berger y Lézine, 1975) es un instrumento de evaluación que se utiliza en la infancia preferentemente para evaluar:
1. La lateralidad.
2. El esquema corporal.
3. La eficacia neuronal.
4. El tono muscular.
5. La motricidad.

Respuesta correcta: 2. El esquema corporal.